一位 5 歲大女生，出現腹水有 1～2 個月的時間，最後診斷為 Budd-Chiari syndrome，其最可能是由下列那條血管阻塞造成？
A. 肝靜脈
B. 肝動脈
C. 肝門靜脈
D. 上腔靜脈

正確答案：A. 肝靜脈